Clinical trial exclusion criterion:
Known coagulation defect

Annotated entities:
- Condition: "coagulation defect"